History of thrombocytopenia or neutropenia

The above is a clinical trial exclusion criterion. Annotated with entity spans:
[Temporal: History] of [Condition: thrombocytopenia] or [Condition: neutropenia]